Clinical trial inclusion criterion:
Subjects completed PEAK can be included within 30 days after End Of the Study

Annotated entities:
- Post-eligibility: "Subjects completed PEAK can be included within 30 days after End Of the Study"